Concurrent medication from Visit 1 and for the duration of the study with any of the prohibited medications: monoamine oxidase inhibitors and tricyclic antidepressants, and ritonavir (a highly potent cytochrome P450 3A4 inhibitor).

The above is a clinical trial exclusion criterion. Annotated with entity spans:
Concurrent [Drug: medication from Visit 1] and for the duration of the study with any of the prohibited medications: [Drug: monoamine oxidase inhibitors] and [Drug: tricyclic antidepressants], and [Drug: ritonavir] (a highly potent [Drug: cytochrome P450 3A4 inhibitor]).